一位 24 歲女性於 7 天前出現雙下肢無力和麻痛，3 天後變得完全無法走路同時出現尿滯留的現象。在過去病史方面，患者於 5 年前曾有左眼視力突然喪失，眼科醫師診斷為視神經炎，而視力於 2 至 3 個月後幾乎完全恢復。另外，在 2 年前患者也曾出現複視和右側肢體偏癱的現象，而此症狀也在 2 個月幾乎完全復原。根據以上之敘述，下列何者是此患者最可能之診斷？
A. 多發性硬化症（multiple sclerosis）
B. 慢性脫髓鞘多發性神經炎（chronic inflammatory demyelinating polyneuropathy）
C. 神經性梅毒（neurosyphilis）
D. 維他命B12缺乏之神經系統併發症

正確答案：A. 多發性硬化症（multiple sclerosis）